Clinical trial exclusion criteria:
Female subjects who are pregnant or breast-feeding or considering becoming pregnant during the study
Patients aged <18 years of age
Patients who cannot give informed consent,
Pregnant patients or those who are breastfeeding will be deemed ineligible.
Prior treatment with any anti-TNF agent
Contra-indication to use of GLM (Hypersensitivity to the active substance or to any of the excipients; Active tuberculosis (TB), acute or chronic Hepatitis B infection or other severe infections such as sepsis and/or opportunistic infections including HIV infection; Moderate or severe heart failure (NYHA class III/IV)
Have symptoms or signs suggestive of current active or latent TB upon medical history, physical examination and/or chest radiograph, or positive Mycobacterium tuberculosis antigen-specific interferon-gamma release assay (IGRA)
Patients with a history of, or at imminent risk for, colectomy; who required gastrointestinal surgery within 2 months before screening;
History of colonic mucosal dysplasia or adenomatous colonic polyps that were not removed
Screening stool study positive for enteric pathogens or Clostridium difficile toxin.
Oral corticosteroids at a dose >40 mg prednisone or its equivalent per day; receipt of cyclosporine, tacrolimus, sirolimus, or mycophenolate mofetil within 8 weeks before the first study agent injection; or use of an investigational agent within 5 half-lives of that agent before the first study agent injection.
Patients in recent receipt of live vaccinations within 4 weeks prior to enrolment

Annotated entities:
- Pregnancy_considerations: "Female subjects who are pregnant or breast-feeding or considering becoming pregnant during the study"
- Person: "aged"
- Value: "<18 years of age"
- Non-query-able: "Patients who cannot give informed consent,"
- Pregnancy_considerations: "Pregnant patients or those who are breastfeeding will be deemed ineligible"
- Drug: "anti-TNF agent"
- Procedure: "treatment"
- Temporal: "Prior"
- Condition: "Contra-indication"
- Drug: "GLM"
- Condition: "Hypersensitivity"
- Drug: "active substance"
- Drug: "excipients"
- Condition: "tuberculosis (TB)"
- Temporal: "Active"
- Qualifier: "acute"
- Qualifier: "chronic"
- Condition: "Hepatitis B infection"
- Condition: "severe infections"
- Condition: "sepsis"
- Condition: "opportunistic infections"
- Condition: "HIV infection"
- Qualifier: "Moderate"
- Qualifier: "severe"
- Condition: "heart failure"
- Measurement: "NYHA"
- Value: "class III/IV"
- Qualifier: "latent"
- Qualifier: "active"
- Temporal: "current"
- Condition: "TB"
- Temporal: "medical history"
- Procedure: "physical examination"
- Procedure: "chest radiograph"
- Measurement: "Mycobacterium tuberculosis antigen-specific interferon-gamma release assay (IGRA)"
- Value: "positive"
- Procedure: "gastrointestinal surgery"
- Temporal: "within 2 months before screening"
- Procedure: "colectomy"
- Mood: "imminent risk for"
- Temporal: "history of"
- Condition: "colonic mucosal dysplasia"
- Condition: "adenomatous colonic polyps"
- Procedure: "removed"
- Negation: "not"
- Procedure: "stool study"
- Value: "positive"
- Qualifier: "enteric pathogens"
- Qualifier: "Clostridium difficile toxin"
- Drug: "Oral corticosteroids"
- Multiplier: ">40 mg prednisone per day"
- Drug: "cyclosporine"
- Drug: "tacrolimus"
- Drug: "sirolimus"
- Drug: "mycophenolate mofetil"
- Temporal: "within 8 weeks before the first study agent injection"
- Drug: "investigational agent"
- Temporal: "within 5 half-lives"
- Temporal: "before the first study agent injection"
- Drug: "live vaccinations"
- Temporal: "within 4 weeks prior to enrolment"